Clinical trial exclusion criterion:
Leg ulcers of another underlying cause

Entity relations:
- Has_qualifier("underlying cause", "another")
- AND("Leg ulcers", "underlying cause")